Entre las enfermedades y trastornos neurológicos con influencia de factores genéticos, NO se encuentra:
1. Epilepsia.
2. Esclerosis Lateral Amiotrófica.
3. Espina Bífida.
4. Ictus.
5. Distrofia muscular de Duchenne.

Respuesta correcta: 4. Ictus.